Clinical trial inclusion criterion:
A spasticity : a Tardieu score upper or equal to 2 on at least one of the following muscle-triceps surae, flexors of fingers, of wrist and of elbow

Entity relations:
- Has_value("Tardieu score", "upper or equal to 2")
- Has_multiplier("muscle-triceps surae", "at least one")
- AND("spasticity", "Tardieu score")
- Has_qualifier("Tardieu score", "muscle-triceps surae")
- OR("muscle-triceps surae", "flexors of fingers", "wrist", "elbow")